Clinical trial exclusion criterion:
Known hepatitis B surface antigen-positive, or known or suspected active hepatitis C infection

Annotated entities:
- Measurement: "hepatitis B surface antigen"
- Value: "positive"
- Condition: "hepatitis C infection"
- Qualifier: "active"